下列何者比較容易產生上肺葉纖維化，肺門淋巴腫大蛋殼樣鈣化；而且較易感染肺結核？
A. silicosis
B. asbestosis
C. berylliosis
D. byssinosis

正確答案：A. silicosis